Which characteristics are used in the SLEDAI index for SLE patients?

The SLEDAi is a "weighted" index of 9 organ systems for disease activity in SLE which includes: 8 for central nervous system and vascular, 4 for renal and musculoskeletal, 2 for serosal, dermal, immunologic, and 1 for constitutional and hematologic.